Clinical trial exclusion criteria:
IBS subtype with constipation
medication: antidepressants or H1-receptor antagonists
pregnancy, breast feeding
co-morbidity: severe kidney- and/or liver disease or other gastrointestinal diseases

Annotated entities:
- Condition: "IBS subtype"
- Condition: "constipation"
- Drug: "antidepressants"
- Drug: "H1-receptor antagonists"
- Condition: "pregnancy"
- Observation: "breast feeding"
- Condition: "kidney disease"
- Condition: "liver disease"
- Qualifier: "severe"
- Condition: "gastrointestinal diseases"